Summarize the cause of autosomal dominant Spinocerebellar Ataxia type 3.

Spinocerebellar ataxia type 3/Machado-Joseph disease (SCA3/MJD) is a dominant neurodegenerative disease caused by the expansion of a CAG repeat tract in ATXN3.